下列何者不是衍生自軸下區肌節（hypaxial division of myotomes）？
A. 頭夾肌（splenius capitis muscle）
B. 中斜角肌（middle scalene muscle）
C. 肋間肌（intercostal muscle）
D. 腰方肌（quadratus lumborum muscle）

正確答案：A. 頭夾肌（splenius capitis muscle）